Patients with a "currently active" second malignancy other than non-melanoma skin cancers are not eligible. Patients are not considered to have a "currently active" malignancy if they have completed all therapy and are now considered without evidence of disease for 1 year. Patients with cognitive dysfunction related to treatment of another malignancy, including a history of "chemo-brain", are ineligible.

The above is a clinical trial exclusion criterion. Annotated with entity spans:
Patients with a "[Qualifier: currently active]" [Multiplier: second] [Condition: malignancy] [Negation: other than] [Condition: non-melanoma skin cancers] are not eligible. Patients are not considered to have a "currently active" malignancy if they have completed all therapy and are now considered without evidence of disease for 1 year. Patients with [Condition: cognitive dysfunction] related to [Procedure: treatment] of [Qualifier: another] [Condition: malignancy], including a history of "chemo-brain", are ineligible.